Clinical trial exclusion criterion:
Transplant from donor positive for HIV, HBsAg, Hepatitis C.

Entity relations:
- AND("donor", "positive for HIV")
- Has_qualifier("Transplant", "donor")
- OR("positive for HIV", "positive for HBsAg", "positive for Hepatitis C")